有關部分分泌腺體（merocrine gland）之敘述，下列敘述何者正確？
A. 分泌產物常與整個細胞一起釋出
B. 分泌產物常與細胞頂端部分一起釋出
C. 為乳腺之脂類的分泌方式
D. 為唾液腺之分泌方式

正確答案：D. 為唾液腺之分泌方式